Clinical trial exclusion criterion:
History of a seizure disorder other than a single childhood febrile seizure.

Entity relations:
- Has_multiplier("childhood febrile seizure", "single")
- Has_temporal("seizure disorder", "History")
- Has_negation("childhood febrile seizure", "other than")
- AND("seizure disorder", "childhood febrile seizure")